Clinical trial exclusion criterion:
Current hormone replacement therapy;

Annotated entities:
- Procedure: "hormone replacement therapy"
- Temporal: "Current"